Clinical trial exclusion criterion:
Myocarditis

Annotated entities:
- Condition: "Myocarditis"